下列何者不是肝癌（hepatocellular carcinoma）手術切除的不良預後因子（poor prognostic factor）？
A. 肝硬化
B. 5 公分以上之肝癌
C. 腫瘤與肝臟切面之距離少於 1 公分
D. 具有莢膜（capsule）之肝癌

正確答案：D. 具有莢膜（capsule）之肝癌